Allergy to benzodiazepines

The above is a clinical trial exclusion criterion. Annotated with entity spans:
[Condition: Allergy] to [Drug: benzodiazepines]